有關於鼻咽癌之敘述，下列何者正確？
A. 頸部淋巴腫大是最常見之初始病徵
B. 鼻咽腫瘤大小通常與淋巴轉移程度成正比
C. 遠端轉移好發處依次為肺、腦、骨
D. 病理學分類以WHO type I最多

正確答案：A. 頸部淋巴腫大是最常見之初始病徵